Clinical trial exclusion criterion:
Patients with uncontrolled cancer;

Annotated entities:
- Qualifier: "uncontrolled"
- Condition: "cancer"